Clinical trial exclusion criterion:
history of > 1 urogenital infection/year

Entity relations:
- Has_multiplier("urogenital infection", "> 1 /year")